Clinical trial exclusion criterion:
5. Subjects with clinically significant cardiovascular disease. This includes:

Entity relations:
- Has_qualifier("cardiovascular disease", "clinically significant")